一種體染色體顯性（Autosomal dominant）遺傳疾病稱為 Familial hyper-cholesterolemia 乃是因為 Low density lipoprotein（LDL）receptor 突變所致。下列有關 LDL 的敘述，何者正確？
A. LDL receptor 只存在肝細胞上
B. LDL 中的膽固醇經由 LDL receptor 之作用，可提供肝細胞合成 Bile salts
C. LDL 所含的脂肪以 Triglyceride 為主
D. LDL 是直接由肝臟製造分泌

正確答案：B. LDL 中的膽固醇經由 LDL receptor 之作用，可提供肝細胞合成 Bile salts